劉太太是一位家庭主婦，現年 55 歲。最近三年雙手發抖相當嚴重，右手幾乎無法用湯匙舀湯或用筷子夾菜，也無法寫字，左手也無法拿碗，然而她仍然可以用鋤頭整地種菜。經詢問病史，雙手發抖已將近 30 年，從右手開始，接著左手也發抖。她的母親以及一位妹妹也有類似長期雙手發抖現象， 只是比較輕微。除此之外，身體沒有其他異狀，也沒有慢性疾病。下列臨床臆斷何者最有可能？
A. 全身性肌張力不全（general dystonia）
B. 脊髓小腦退化症（spinocerebellar degeneration）
C. 帕金森氏症（Parkinson's disease）
D. 原發性顫抖症（essential tremor）

正確答案：D. 原發性顫抖症（essential tremor）